Clinical trial exclusion criteria:
Children will be excluded if they have a history of developmental delay or inability to communicate the effects of an allergic reaction (non-verbal).
Any contraindication to allergy testing will also result in exclusion
(i.e. history of a severe allergic reaction to skin tests,,
anaphylaxis in the past six weeks,
pregnancy,
child took any antihistamine in the past three days [including diphenhydramine (Benadryl®), cetirizine (Zyrtec®), loratadine (Claritin®), fexofenadine (Allegra®), levocetirizine (Xyzal®), and desloratadine (Clarinex®)] or
child has a history of a condition that requires a beta blocker medicine for cardiac conditions, high blood pressure, migraine headaches, or eye drops for glaucoma (e.g. propranolol, metoprolol, atenolol and Timoptic®, or Betoptic® eye drops).
Children who present to the PED with a rash, vomiting or current asthma symptoms including coughing, wheezing or breathing problems will also be excluded to ensure these do not mask reactions to an oral challenge.
Patients being admitted to the hospital or those who are deemed too acutely ill for participation (triage level 1 or 2 or as determined by the ED patient care team) will be excluded from the study.
During this pilot study, we will exclude non-English speaking families. However, in subsequent studies we will include the non-English speaking population.
Children who are wards of the state, in foster care or police custody or detention will be excluded.
Children with any basal condition (trauma, infection, minor accidents, etc..) will be able to participate in the study provided they and their family are willing and do not meet the above-mentioned exclusion criteria.

Annotated entities:
- Person: "Children"
- Condition: "developmental delay"
- Condition: "inability to communicate the effects"
- Condition: "allergic reaction"
- Qualifier: "non-verbal"
- Condition: "contraindication"
- Procedure: "allergy testing"
- Condition: "severe allergic reaction"
- Procedure: "skin tests"
- Temporal: "history"
- Condition: "anaphylaxis"
- Temporal: "in the past six weeks"
- Condition: "pregnancy"
- Drug: "antihistamine"
- Temporal: "in the past three days"
- Drug: "diphenhydramine"
- Drug: "Benadryl"
- Drug: "cetirizine"
- Drug: "Zyrtec"
- Drug: "loratadine"
- Drug: "Claritin"
- Drug: "fexofenadine"
- Drug: "Allegra"
- Drug: "levocetirizine"
- Drug: "Xyzal"
- Drug: "desloratadine"
- Drug: "Clarinex"
- Drug: "beta blocker medicine"
- Condition: "cardiac conditions"
- Condition: "high blood pressure"
- Condition: "migraine headaches"
- Condition: "glaucoma"
- Drug: "eye drops"
- Drug: "propranolol"
- Drug: "metoprolol"
- Drug: "atenolol"
- Drug: "Timoptic"
- Drug: "Betoptic"
- Drug: "eye drops"
- Person: "Children"
- Visit: "PED"
- Condition: "rash"
- Condition: "vomiting"
- Condition: "asthma symptoms"
- Condition: "coughing"
- Condition: "wheezing"
- Condition: "breathing problems"
- Temporal: "current"
- Non-query-able: "Patients being admitted to the hospital or those who are deemed too acutely ill for participation (triage level 1 or 2 or as determined by the ED patient care team) will be excluded from the study."
- Observation: "non-English speaking"
- Non-representable: "However, in subsequent studies we will include the non-English speaking population."
- Observation: "wards of the state"
- Observation: "foster care"
- Observation: "police custody"
- Observation: "detention"
- Condition: "basal condition"
- Condition: "trauma"
- Condition: "infection"
- Condition: "minor accidents"